一位 86 歲男性因 1 小時前突發性腹痛入急診。病人有消化性潰瘍病史，規則於門診用藥治療。理學檢查發現腸音稍慢，瀰漫性壓痛（diffuse tenderness）與反彈痛（rebound tenderness），肛門檢查有些微黑便（tarry stool）。假如你想排除消化性潰瘍穿孔（perforated peptic ulcer）的可能性，除了站立性胸部 X 光（upright CXR）以外，下列何者為最適合且快速的檢查？
A. 胃灌洗（gastric lavage）
B. 胃鏡（upper gastrointestinal endoscopy）
C. 上消化道攝影（upper GI series）
D. 左側躺腹部 X 光（left decubitus, plain abdomen）

正確答案：D. 左側躺腹部 X 光（left decubitus, plain abdomen）